Limb disabled;

The above is a clinical trial exclusion criterion. Annotated with entity spans:
[Condition: Limb disabled];